抗憂鬱劑（antidepressant）是治療慢性疼痛的一種藥物，它的機轉是阻斷了那一個神經傳遞物 （neurotransmitter）的再吸收？
A. adenosine
B. substance P
C. serotonin
D. γ-aminobutyric acid（GABA）

正確答案：C. serotonin